Clinical trial exclusion criterion:
Severe concomitant disease with life expectancy below 12 months;

Annotated entities:
- Qualifier: "Severe"
- Temporal: "concomitant"
- Condition: "disease"
- Observation: "life expectancy"
- Value: "below 12 months"